治療雙極性疾患（bipolar disorder）用的 lithium 及 valproic acid 的致畸胎性為：
A. 只有 lithium 會產生胎兒畸型
B. 只有 valproic acid 會產生胎兒畸型
C. lithium 及 valproic acid 皆會產生胎兒畸型
D. lithium 及 valproic acid 皆不會產生胎兒畸型

正確答案：C. lithium 及 valproic acid 皆會產生胎兒畸型